Which tool has been developed for microRNA-target enrichment and network-based analysis?

MIENTURNET (MicroRNA ENrichment TURned NETwork) is an interactive web tool for microRNA-target enrichment and network-based analysis.